Clinical trial exclusion criterion:
Renal failure not due to LAL

Annotated entities:
- Condition: "Renal failure"
- Condition: "LAL"
- Negation: "not"
- Mood: "due to"